Clinical trial inclusion criterion:
glatiramer acetate,

Annotated entities:
- Drug: "glatiramer acetate"